En relación con la fisiología del sistema del complemento una de las siguientes afirmaciones es falsa:
1. La mayoría de sus componentes se encuentra de forma inactiva.
2. Su modo de activación es similar a la cascada de coagulación.
3. Se encuentra sometido a control estricto de mecanismos reguladores.
4. Sólo se activa mediante dos vías diferentes: la clásica y la alternativa.
5. Durante su activación se forman complejos multimoleculares.

Respuesta correcta: 4. Sólo se activa mediante dos vías diferentes: la clásica y la alternativa.